一中年男子從事多年勞力工作後，主訴背部疼痛，且一側下肢肌肉無力。下列那一肌肉的功能缺失，可以確認是第一節薦神經（S1 spinal nerve）的受傷，而不是坐骨神經的受傷？
A. 股二頭肌
B. 腓腸肌
C. 臀大肌
D. 脛前肌

正確答案：C. 臀大肌